缺乏那一種激素是引起尿崩症（diabetes insipidus）的主要原因？此激素在何處生成（synthesis）？
A. 血管加壓素（vasopressin）；腦下腺後葉
B. 催產素（oxytocin）；腦下腺後葉
C. 催產素；下視丘
D. 血管加壓素；下視丘

正確答案：D. 血管加壓素；下視丘